Clinical trial exclusion criterion:
Poorly controlled diabetes mellitus (HbA1C > 7.5)

Entity relations:
- Has_qualifier("diabetes mellitus", "Poorly controlled")
- Has_value("HbA1C", "> 7.5")
- AND("diabetes mellitus", "HbA1C")